undergoing day-case knee arthroscopy

The above is a clinical trial inclusion criterion. Annotated with entity spans:
undergoing day-case [Procedure: knee arthroscopy]